Indique cuál de las siguientes es una anemia hemolítica corpuscular adquirida:
1. Hemoglobinuria paroxística nocturna.
2. Déficit de glucosa 6 fosfato deshidrogenasa.
3. Enfermedad de Minkowski-Chauffard
4. Anemia drepanocítica.
5. Déficit de piruvatoquinasa.

Respuesta correcta: 1. Hemoglobinuria paroxística nocturna.